Clinically significant medical history

The above is a clinical trial exclusion criterion. Annotated with entity spans:
[Qualifier: Clinically significant] [Temporal: medical history]